45歲的秦先生被家屬勸來醫院。他們帶來秦先生的各項檢查結果，並轉述之前醫師的說法，認為秦先生有明顯的酒精性肝傷害，要你說服他戒酒。家屬所提供的數據皆支持秦先生有酒精性肝傷害，除了：
A. alanine aminotransferase（ALT）< aspartate aminotransferase（AST）
B. 血中γ-GT數值偏高
C. 超音波顯示有脂肪肝（fatty liver）現象
D. ALT>2000 U/L（normal：0～40）

正確答案：D. ALT>2000 U/L（normal：0～40）